Clinical trial inclusion criterion:
1. Age 18-80 years

Annotated entities:
- Parsing_Error: "1."
- Person: "Age"
- Value: "18-80 years"